1. Resisted hypertension

The above is a clinical trial exclusion criterion. Annotated with entity spans:
[Parsing_Error: 1.] [Condition: Resisted hypertension]